Clinical trial inclusion criterion:
Patients with either Relapsing-remitting MS (RRMS), Secondary progressive MS (SPMS), or Primary progressive MS (PPMS) by McDonald 2010 criteria.

Entity relations:
- OR("Relapsing-remitting MS (RRMS)", "Primary progressive MS (PPMS)", "Secondary progressive MS (SPMS)")